Clinical trial exclusion criterion:
Patients scheduled to undergo revision total knee arthroplasty for infectious reasons.

Entity relations:
- AND("revision total knee arthroplasty", "infectious reasons")